Clinical trial exclusion criterion:
Serious adverse reaction to any vaccination, as respiratory difficulty, angioedema and anaphylaxis;

Entity relations:
- AND("adverse reaction", "vaccination")
- Subsumes("adverse reaction", "respiratory difficulty")
- Subsumes("adverse reaction", "angioedema")
- Subsumes("adverse reaction", "anaphylaxis")